History of allergic or hypersensitivity to tandospirone

The above is a clinical trial exclusion criterion. Annotated with entity spans:
History of [Condition: allergic] or [Condition: hypersensitivity] to [Drug: tandospirone]